Clinical trial exclusion criterion:
• Investigational medications (30 days or 5 half-lives off drug, whichever is longer)

Annotated entities:
- Drug: "Investigational medications"
- Temporal: "30 days off drug"
- Temporal: "5 half-lives off drug"